一位30歲女性主訴有牙齒鬆動、傷口不易癒合等症狀，口腔理學檢查發現牙齦浮腫、牙齦泛紫。根據病史，此病患最可能有下列何種維生素缺乏？
A. 維生素B1
B. 維生素B12
C. 維生素C
D. 維生素A

正確答案：C. 維生素C